age <18 years;

The above is a clinical trial exclusion criterion. Annotated with entity spans:
[Person: age] [Value: <18 years];